骨骺板（epiphyseal plate）中，下列何者的軟骨細胞會進行細胞凋亡（apoptosis）？
A. 軟骨鈣化區（zone of calcified cartilage）
B. 軟骨肥大區（zone of hypertrophy）
C. 軟骨增生區（zone of proliferation）
D. 軟骨儲備區（zone of reserve cartilage）

正確答案：A. 軟骨鈣化區（zone of calcified cartilage）